下列有關眼睛（eye）發育的敘述，何者錯誤？
A. 眼裂（optic fissure）位於眼杯（optic cup）的腹側面，並沿	視柄（optic stalk）發育
B. 視網膜中央動脈和靜脈（central artery and vein of retina）是源自遠側端玻璃體血管（hyaloid vessels）的衍生物
C. 視網膜色素上皮（retinal pigment epithelium）是源自眼杯（optic cup）的外層
D. 視神經（optic nerve）是源自視網膜之神經節細胞軸突（axons of ganglion cells）

正確答案：B. 視網膜中央動脈和靜脈（central artery and vein of retina）是源自遠側端玻璃體血管（hyaloid vessels）的衍生物